Clinical trial exclusion criterion:
History of hepatic encephalopathy or variceal hemorrhage

Annotated entities:
- Condition: "hepatic encephalopathy"
- Condition: "variceal hemorrhage"